Previous pregnancy complicated by gestational diabetes

The above is a clinical trial inclusion criterion. Annotated with entity spans:
Previous [Condition: pregnancy] complicated by [Condition: gestational diabetes]